What gene is mutated in Familial Mediterranean Fever?

The MEFV gene which encodes the pyrin protein is mutated in Familial Mediterranean Fever(FMF).